Clinical trial exclusion criteria:
No known history of seizure activity.
Pregnant or breastfeeding.
Renal dysfunction (CrCl < 30ml/min).
Beck's Depression Inventory (BDI) =14
Allergy to levetiracetam.

Annotated entities:
- Negation: "No"
- Temporal: "history"
- Condition: "seizure activity"
- Condition: "Pregnant"
- Observation: "breastfeeding"
- Condition: "Renal dysfunction"
- Measurement: "CrCl"
- Value: "< 30ml/min"
- Measurement: "Beck's Depression Inventory (BDI)"
- Value: "=14"
- Condition: "Allergy"
- Drug: "levetiracetam"